Clinical trial exclusion criterion:
Volunteers must not have been vaccinated against HPV-Gardasil-9 (both partners)

Annotated entities:
- Negation: "not"
- Temporal: "have been"
- Procedure: "vaccinated"
- Condition: "HPV-Gardasil-9"